Las células alveolares de tipo II:
1. Recubren el 95% del epitelio alveolar.
2. Forman la superficie para el intercambio gaseoso.
3. Presentan gránulos con heparina e histamina.
4. Segregan agente surfactante.

Respuesta correcta: 4. Segregan agente surfactante.